Clinical trial exclusion criterion:
Fibrates (must be on stable dose for ≥3 months);

Annotated entities:
- Drug: "Fibrates"
- Qualifier: "stable dose"
- Temporal: "≥3 months"